Male & female patients >= 18 and < 70 years of age

The above is a clinical trial inclusion criterion. Annotated with entity spans:
[Person: Male] & [Person: female] patients [Value: >= 18 and < 70 years] of [Person: age]